recent thrombotic event

The above is a clinical trial exclusion criterion. Annotated with entity spans:
[Temporal: recent] [Condition: thrombotic event]